Type 2 diabetes mellitus with HbA1c > 7.5 %

The above is a clinical trial inclusion criterion. Annotated with entity spans:
[Condition: Type 2 diabetes mellitus] with [Measurement: HbA1c] [Value: > 7.5 %]